Clinical trial exclusion criterion:
3. Cutaneous lesions and/or pressure ulcers

Annotated entities:
- Parsing_Error: "3."
- Condition: "Cutaneous lesions"
- Condition: "pressure ulcers"